Clinical trial exclusion criterion:
4. Diagnosis of Omenn's syndrome or MHC class I deficiency

Entity relations:
- OR("Omenn's syndrome", "MHC class I deficiency")